Chronic opiate use

The above is a clinical trial exclusion criterion. Annotated with entity spans:
[Multiplier: Chronic] [Drug: opiate] use